Clinical trial exclusion criterion:
Any other illness or infection (latent or active) that, in the Investigator's opinion, could be exacerbated by study medication

Entity relations:
- multi("active", "active")
- multi("exacerbated by study medication", "study medication")
- AND("exacerbated by study medication", "in the Investigator's opinion")
- Has_qualifier("illness", "latent")
- Has_qualifier("illness", "exacerbated by study medication")
- OR("latent", "active")
- OR("illness", "infection")